關於結核桿菌（Mycobacterium tuberculosis）之敘述，下列何者正確？
A. 齧齒類動物（rodents）為此菌之傳播者
B. 此菌不易染色，但一旦染上後，即使用酸性溶液也不易脫色
C. 此菌具移動性且會形成內孢子（endospores）
D. 此菌能產生外毒素（exotoxin）以避免吞噬細胞之吞食

正確答案：B. 此菌不易染色，但一旦染上後，即使用酸性溶液也不易脫色